Patients who are pregnant or plan to become pregnant

The above is a clinical trial exclusion criterion. Annotated with entity spans:
[Pregnancy_considerations: Patients who are pregnant or plan to become pregnant]